Clinical trial exclusion criterion:
Colistin use less than 72 hours

Annotated entities:
- Drug: "Colistin"
- Temporal: "less than 72 hours"